一位 65 歲女性，身材肥胖，罹患糖尿病 10 年，但不規則就醫服藥，一星期前在腋下、乳房下和鼠蹊部出現刺癢的紅色斑，周圍伴有衛星狀分布之膿疱，下列何者為最可能的診斷？
A. 膿痂疹（impetigo）
B. 毛囊炎（folliculitis）
C. 單純性疱疹病毒感染（Herpes simplex virus infection）
D. 皮膚念珠菌感染（cutaneous candidiasis）

正確答案：D. 皮膚念珠菌感染（cutaneous candidiasis）